Clinical trial exclusion criteria:
Active bleeding without control;
Receiving nasal or facial surgery recently;
With severe cardio-pulmonary dysfunction, such as left heart failure, unstable arrhythmia, etc.
With other respiratory diseases: such as active pulmonary tuberculosis, non-tuberculosis mycobacteria (NTM) pulmonary disease, pulmonary aspergillosis, etc.
Be allergic to amikacin

Annotated entities:
- Condition: "bleeding"
- Qualifier: "Active"
- Procedure: "facial surgery"
- Procedure: "nasal surgery"
- Condition: "cardio-pulmonary dysfunction"
- Qualifier: "severe"
- Condition: "left heart failure"
- Condition: "arrhythmia"
- Qualifier: "unstable"
- Condition: "respiratory diseases"
- Condition: "pulmonary tuberculosis"
- Qualifier: "active"
- Condition: "non-tuberculosis mycobacteria pulmonary disease"
- Condition: "NTM"
- Condition: "pulmonary aspergillosis"
- Condition: "allergic"
- Drug: "amikacin"